一位 49 歲男性病人，最近一個月來感覺全身倦怠及疲勞，生化檢查顯示：total protein 5.9 g/dL，albumin  8 g/dL，ALT 105 U/L，AST 350 U/L，alkaline phosphatase 250 U/L（正常值＜100 U/L），γ-glutamyl transpeptidase 292 U/L（正常值＜60 U/L），total bilirubin 6.8 mg/dL，direct bilirubin 4.1 mg/dL。下列何者為最可能的診斷？
A. 病毒性肝炎
B. 溶血
C. Gilbert 氏症候群
D. 酒精性肝炎

正確答案：D. 酒精性肝炎